治療注意力缺損／過動疾患（attention-deficit / hyperactivity disorder）之兒童青少年病患使用神經刺激劑 （stimulants）前，那個不是一般建議要先測量的項目？
A. 血壓
B. 心跳
C. 血糖
D. 身高

正確答案：C. 血糖